下列何者不是足月新生兒會有的正常姿勢？
A. 平躺時四肢呈屈曲姿勢
B. 俯臥時骨盆會平貼床面
C. 驚嚇時雙手先向外伸張，再作擁抱狀
D. 頭轉向一側，同側手腳呈現伸張姿勢

正確答案：B. 俯臥時骨盆會平貼床面